toxicity, intolerance or virological failure if receiving an NNRTI containing regimen at screening

The above is a clinical trial inclusion criterion. Annotated with entity spans:
[Condition: toxicity], [Condition: intolerance] or [Condition: virological failure] if receiving an [Procedure: NNRTI containing regimen] [Temporal: at screening]